Clinical trial exclusion criterion:
Current tobacco use.

Entity relations:
- Has_temporal("tobacco use", "Current")